Clinical trial exclusion criterion:
younger than 18 years old

Entity relations:
- Has_value("old", "younger than 18 years")